Clinical trial inclusion criteria:
Children undergoing ENT surgery under general anaesthesia.

Annotated entities:
- Person: "Children"
- Procedure: "ENT surgery"
- Temporal: "undergoing"
- Procedure: "general anaesthesia"